Diagnosis of cancer.

The above is a clinical trial exclusion criterion. Annotated with entity spans:
Diagnosis of [Condition: cancer].